Clinical trial inclusion criterion:
Acquired acute ankle injury (injured less than 48 hours ago);

Annotated entities:
- Condition: "acute ankle injury"
- Qualifier: "Acquired"
- Temporal: "less than 48 hours ago"